人體中數量最少的白血球是：
A. 淋巴球（lymphocytes）
B. 嗜中性球（neutrophils）
C. 嗜伊紅球（eosinophils）
D. 嗜鹼性球（basophils）

正確答案：D. 嗜鹼性球（basophils）